For women of childbearing potential, a negative pregnancy test is required during screening

The above is a clinical trial inclusion criterion. Annotated with entity spans:
For [Person: women] of [Observation: childbearing potential], a [Value: negative] [Measurement: pregnancy test] is required [Temporal: during screening]